Need for emergency surgery for any reason.

The above is a clinical trial exclusion criterion. Annotated with entity spans:
[Mood: Need for] [Procedure: emergency surgery] for any reason.